Chronic usage of analgesic drugs.

The above is a clinical trial exclusion criterion. Annotated with entity spans:
Chronic usage of [Drug: analgesic drugs].